¿Cuál es el criterio fundamental que siguen los sistemas diagnósticos (DSM y CIE) para clasificar las disfunciones sexuales?:
1. Gravedad.
2. Etiología.
3. Duración.
4. Fase del ciclo de la respuesta sexual.

Respuesta correcta: 4. Fase del ciclo de la respuesta sexual.